Clinical trial exclusion criterion:
mental retardation or organic brain damage

Entity relations:
- OR("mental retardation", "organic brain damage")